What is latex bead phagocytosis?

Macrophage scavenger function was assessed by an in vitro latex bead phagocytosis assay.
We developed a scanning cytometry-based high-throughput assay of macrophage phagocytosis that quantitates bound and internalized unopsonized latex beads.